1cm squared surface area

The above is a clinical trial inclusion criterion. Annotated with entity spans:
[Value: 1cm squared] [Measurement: surface area]